Si un método analítico permite determinar 1 ppm de Pb, nos estamos refiriendo a:
1. 1 mg/L.
2. 1 mg/mL.
3. 1 µg/L.
4. 1 ng/L.
5. 1 ng/mL.

Respuesta correcta: 1. 1 mg/L.